一位21歲男性大學生於凌晨2點被友人送至急診室，據其友人描述：該患者於參加派對時，吞服紅色和藍色的圓形藥丸各1顆後，突然覺得心悸、胸悶、視力模糊、全身盜汗、步態不穩、意識混亂、並有視幻覺。該名患者最可能用了下列何種非法藥物？
A. K他命（ketamine）
B. 古柯鹼（cocaine）
C. 搖頭丸（3, 4-methylenedioxymethamphetamine; MDMA）
D. 天使塵（phencyclidine; PCP）

正確答案：C. 搖頭丸（3, 4-methylenedioxymethamphetamine; MDMA）